Clinical trial inclusion criterion:
resection must have been histologically complete laterally with regard to the microinvasive cancer, that is to say with a clear margin of safety (margin may be high-grade dysplasia provided that the latter has not macroscopic translation),

Annotated entities:
- Condition: "resection"
- Procedure: "histologically"
- Qualifier: "complete laterally"
- Non-representable: "that is to say with a clear margin of safety (margin may be high-grade dysplasia provided that the latter has not macroscopic translation),"
- Condition: "microinvasive cancer"